下列有關血清素再吸收阻斷劑 fluoxetine 與三環類抗憂鬱藥物 amitriptyline 作用之比較，何者錯誤？
A. 前者較不適用於前列腺肥大的病人
B. 前者較不會產生鎮靜作用（sedative action）
C. 前者較不會產生直立性低血壓（orthostatic hypotension）的副作用
D. 前者較不會產生視覺模糊及口乾等的副作用

正確答案：A. 前者較不適用於前列腺肥大的病人